El principal estímulo para la secreción de secretina es la presencia en el duodeno de:
1. pH ácido.
2. Hidratos de carbono.
3. Proteínas.
4. Quimo hipoosmolar.
5. Quimo hiperosmolar.

Respuesta correcta: 1. pH ácido.